Clinical trial exclusion criterion:
presence of contraindications, current or past allergic or adverse reaction, or known sensitivity to cannabinoid-like substances (dronabinol/marijuana/cannabis/THC, cannabinoid oil, sesame oil, gelatin, glycerin, and titanium dioxide)

Annotated entities:
- Condition: "contraindications"
- Temporal: "current"
- Temporal: "past"
- Condition: "allergic reaction"
- Condition: "adverse reaction"
- Condition: "sensitivity"
- Drug: "cannabinoid-like substances"
- Drug: "dronabinol"
- Drug: "marijuana"
- Drug: "cannabis"
- Drug: "THC"
- Drug: "cannabinoid oil"
- Drug: "sesame oil"
- Drug: "gelatin"
- Drug: "glycerin"
- Drug: "titanium dioxide"